Clinical trial exclusion criterion:
Have symptoms or signs suggestive of current active or latent TB upon medical history, physical examination and/or chest radiograph, or positive Mycobacterium tuberculosis antigen-specific interferon-gamma release assay (IGRA)

Annotated entities:
- Qualifier: "latent"
- Qualifier: "active"
- Temporal: "current"
- Condition: "TB"
- Temporal: "medical history"
- Procedure: "physical examination"
- Procedure: "chest radiograph"
- Measurement: "Mycobacterium tuberculosis antigen-specific interferon-gamma release assay (IGRA)"
- Value: "positive"